Clinical trial exclusion criterion:
Previous history of intolerance to recommended target doses of ACEIs or ARBs.

Annotated entities:
- Drug: "ACEIs"
- Drug: "ARBs"
- Condition: "intolerance"
- Temporal: "history"
- Temporal: "Previous"